Clinical trial inclusion criterion:
All patients admitted to the Duke CICU, who require intubation and sedation for mechanical ventilation that is expected to be >24 hours in duration will be included, unless they meet the specified exclusion criteria.

Entity relations:
- AND("admitted", "Duke CICU")
- Has_mood(">24 hours in duration", "expected to be")
- Has_multiplier("mechanical ventilation", ">24 hours in duration")
- AND("intubation", "mechanical ventilation")
- AND("sedation", "mechanical ventilation")